與醫療品質相關的通報系統，分為政策推動與政策鼓勵兩大類，以下何者不屬於政策推動之通報系統？
A. 癌症登記系統
B. 癌症篩檢系統
C. 院內感染監測資訊系統
D. 全國藥品不良反應通報系統

正確答案：B. 癌症篩檢系統